age greater than 18 years old

The above is a clinical trial inclusion criterion. Annotated with entity spans:
[Person: age] [Value: greater than 18 years old]